Clinical trial exclusion criterion:
Has been in receipt of any licensed vaccine within 14 days prior to the first dose of study vaccine/placebo, plans to receive within 14 days after the first study vaccination, or plans to receive within 14 days before or after the second, third or fourth vaccination

Entity relations:
- Has_index("within 14 days prior", "the first dose of study vaccine/placebo")
- Has_index("within 14 days before or after", "second, third or fourth vaccination")
- Has_temporal("licensed vaccine", "within 14 days prior")
- Has_index("licensed vaccine", "first study vaccination")
- AND("licensed vaccine", "study vaccine")
- AND("licensed vaccine", "placebo")
- AND("licensed vaccine", "study vaccination")
- AND("licensed vaccine", "vaccination")
- OR("within 14 days prior", "within 14 days after", "within 14 days before or after")